Subject with hypotension and a resting systolic blood pressure of < 90 mmHG or hypertension with a resting systolic blood pressure > 170 mmHG or a resting diastolic blood pressure > 110 mmHG

The above is a clinical trial exclusion criterion. Annotated with entity spans:
Subject with [Condition: hypotension] and a resting [Measurement: systolic blood pressure] of [Value: < 90 mmHG] or [Condition: hypertension] with a resting [Measurement: systolic blood pressure] [Value: > 170 mmHG] or a resting [Measurement: diastolic blood pressure] [Value: > 110 mmHG]